Regular smoker (> 5 cigarettes, > 1 pipeful or > 1 cigar per day)

The above is a clinical trial exclusion criterion. Annotated with entity spans:
[Condition: Regular smoker] ([Multiplier: > 5] [Observation: cigarettes], [Multiplier: > 1] [Observation: pipeful] or [Multiplier: > 1] [Observation: cigar] per day)